Which package in Bioconductor has been developed with the aim to analyze differential DNA loops from sequencing data?

Diffloop is an R/Bioconductor package that provides a suite of functions for the quality control, statistical testing, annotation, and visualization of DNA loops.